Clinical trial inclusion criteria:
Age 18 or older with unilateral or bilateral inguinal herna for laparoscopic repair
American Society of Anesthesiology (ASA) Class I and II

Annotated entities:
- Person: "Age"
- Value: "18 or older"
- Qualifier: "unilateral"
- Qualifier: "bilateral"
- Condition: "inguinal herna"
- Qualifier: "for laparoscopic repair"
- Procedure: "laparoscopic repair"
- Measurement: "American Society of Anesthesiology (ASA) Class"
- Value: "I and II"